下列有關肥胖婦女的敘述，何者正確？
A. 子宮內膜癌症危險降低
B. 性荷爾蒙結合球蛋白（sex hormone binding globulin）降低
C. 游離雄性素降低
D. 雌素酮（estrone）降低

正確答案：B. 性荷爾蒙結合球蛋白（sex hormone binding globulin）降低